Clinical trial inclusion criteria:
Age 3 to 18 years on day of surgery
diagnosis of spinal deformity
undergoing elective posterior spine multi-level instrumentation surgery

Annotated entities:
- Person: "Age"
- Value: "3 to 18 years"
- Temporal: "on day of surgery"
- Condition: "spinal deformity"
- Temporal: "undergoing"
- Qualifier: "elective"
- Qualifier: "posterior spine"
- Procedure: "multi-level instrumentation surgery"